Healthy, women ages 18 to 39yo with BMI <30

The above is a clinical trial inclusion criterion. Annotated with entity spans:
[Condition: Healthy], [Person: women] [Person: ages] [Value: 18 to 39yo] with [Measurement: BMI] [Value: <30]